下列何種細胞直接參與抗體依存性細胞毒殺反應（antibody-dependent cell-mediated cytotoxicity， ADCC）？
A. 自然殺手細胞
B. B 淋巴細胞
C. CD8+ T 淋巴細胞
D. CD4+ T 淋巴細胞

正確答案：A. 自然殺手細胞